Clinical trial exclusion criterion:
Pregnant or nursing woman

Entity relations:
- OR("Pregnant", "nursing")